Participants must be able to understand and sign the Informed Consent, and comply with all aspects of the protocol.

The above is a clinical trial inclusion criterion. Annotated with entity spans:
Participants must [Mood: be able to] [Informed_consent: understand and sign the Informed Consent], and [Informed_consent: comply with all aspects of the protocol].